Clinical trial inclusion criterion:
Regular menstrual cycles with duration between 24-35 days

Annotated entities:
- Condition: "Regular menstrual cycles"
- Value: "between 24-35 days"
- Measurement: "duration"